Which is the enzymatic activity of the myotubularin family of proteins?

The myotubularin family of proteins are lipid inositol phosphatases